¿Qué citocromo P450 representa una mayor contribución relativa en el metabolismo de fármacos?:
1. 2D6.
2. 2E1.
3. 1A2.
4. 3A4.

Respuesta correcta: 4. 3A4.